Type 2 diabetes mellitus

The above is a clinical trial inclusion criterion. Annotated with entity spans:
[Condition: Type 2 diabetes mellitus]